Clinical trial inclusion criterion:
Subjects planned to be implanted with the RELIANCE 4-FRONT Passive Fixation Lead

Annotated entities:
- Mood: "planned"
- Procedure: "implanted with the RELIANCE 4-FRONT Passive Fixation Lead"
- Device: "RELIANCE 4-FRONT Passive Fixation Lead"